6. Ability to read and write English -

The above is a clinical trial inclusion criterion. Annotated with entity spans:
6. [Post-eligibility: Ability to read and write English -]